在寒冷的冬天晚上，救護技術員送一位 43 歲流浪漢入急診。病人意識不清，無呼吸心跳，體溫為 29℃。你開始為他做心肺復甦術，心電圖顯示為心室顫動（ventricular fibrillation），接下來的處置何者最為適當？
A. 按照一般高級心臟救命術的流程處置，以去顫術（defibrillation）與使用 epinephrine 為主
B. 可做一次去顫術，不需使用藥物，並繼續做心肺復甦術、插管與回溫治療
C. 因為病人正在急救，不適合做體內回溫，以被動體外回溫為主
D. 若病人體溫持續低於 30℃超過 30 分鐘，無論心律為何，皆可考慮放棄急救

正確答案：B. 可做一次去顫術，不需使用藥物，並繼續做心肺復甦術、插管與回溫治療